Clinical trial exclusion criterion:
Complex or altered abdominal wall anatomy

Annotated entities:
- Condition: "altered abdominal wall anatomy"
- Condition: "Complex abdominal wall anatomy"